Clinical trial inclusion criterion:
Body weight >= 50 kilogram (kg) and body mass index within the range 19 - 24.9 kg/m^2 (inclusive).

Entity relations:
- Has_value("body mass index", "within the range 19 - 24.9 kg/m^2")
- Has_value("Body weight", ">= 50 kilogram (kg)")